Clinical trial exclusion criterion:
Known history of central nervous system damage (i.e. neoplasm, aneurysm, intracranial or spinal surgery) or recent trauma to the head or cranium (i.e. < 3 months)

Entity relations:
- Subsumes("central nervous system damage", "neoplasm")
- Has_qualifier("trauma", "head")
- Has_temporal("trauma", "< 3 months")
- OR("neoplasm", "aneurysm", "intracranial surgery", "spinal surgery")
- OR("head", "cranium")